Constitutional illness (eg, persistent unexplained fever, diarrhea, significant weight loss, disabling weakness) within 30 days of screening

The above is a clinical trial exclusion criterion. Annotated with entity spans:
[Condition: Constitutional illness] (eg, [Multiplier: persistent] [Condition: unexplained fever], [Condition: diarrhea], [Qualifier: significant] [Condition: weight loss], [Condition: disabling weakness]) [Temporal: within 30 days of screening]